腹內實質臟器發生鈍性挫傷時，非手術療法（nonoperative management）已成為常態性之治療方式。當摩托車騎士受傷後，經確認診斷為單獨性肝臟裂傷（isolated liver laceration），經採用非手術療法後，下列何種合併症比較不會出現？
A. 延遲性腹內出血（delayed hemorrhage）
B. 肝膿瘍（liver abscess）
C. 黃疸（jaundice）
D. 血尿（hematuria）

正確答案：D. 血尿（hematuria）